Have a normal ECG; must not have the following to be acceptable: pathologic Q wave abnormalities, significant ST-T wave changes, left ventricular hypertrophy, right bundle branch block, left bundle branch block. (sinus rhythm is between 55-100 beats per minute)

The above is a clinical trial inclusion criterion. Annotated with entity spans:
Have a [Value: normal] [Measurement: ECG]; must [Negation: not] have the following to be acceptable: [Observation: pathologic Q wave abnormalities], significant [Observation: ST-T wave changes], [Condition: left ventricular hypertrophy], [Condition: right bundle branch block], [Condition: left bundle branch block]. (sinus rhythm is between 55-100 beats per minute)